下列關於衛氏肺吸蟲（Paragonimus westermani）的敘述，那些正確？①可在病人痰液中找到蟲卵 ②蟲卵不具小蓋，內有纖毛幼蟲（miracidium） ③長期感染的病人，臨床症狀與肺結核類似 ④人是第二中間宿主
A. ①③
B. ①④
C. ②③
D. ②④

正確答案：A. ①③